一位 20 歲男性，因車禍而被送至急診處，經診治後發現，除四肢多處挫擦傷外，於左下肢有一長約 公分、深約 2 公分之不規則撕裂傷口。關於此撕裂傷口，下列何者處置方式錯誤？
A. 以優碘溶液沖洗傷口內部
B. 以優碘溶液消毒傷口周圍皮膚
C. 以生理食鹽水沖洗傷口內部
D. 給與破傷風預防注射

正確答案：A. 以優碘溶液沖洗傷口內部